一位 15 歲的女性在最近兩個月經常有多發性關節疼痛及肌肉酸痛，且口腔上及頰部黏膜有重複性潰瘍發生。另外家人也注意到患者的臉部有紅斑出現。在懷疑有"紅斑性狼瘡＂之虞時，下列何種血清學檢查最有助於本疾病的診斷？
A. serum electrophoresis
B. serum complement C3 and C4
C. anti-dsDNA antibodies
D. Coombs' test

正確答案：C. anti-dsDNA antibodies